Subjects with non-functional CICC or PICC distal ports

The above is a clinical trial exclusion criterion. Annotated with entity spans:
Subjects with [Qualifier: non-functional] [Device: CICC] or [Device: PICC distal ports]